Clinical trial exclusion criterion:
Renal disease unrelated to SLE (e.g. diabetes mellitus, other glomerular or tubulointerstitial disease, renovascular disease), or transplanted kidney.

Annotated entities:
- Condition: "Renal disease"
- Negation: "unrelated"
- Condition: "SLE"
- Condition: "diabetes mellitus"
- Condition: "tubulointerstitial disease"
- Condition: "glomerular disease"
- Condition: "renovascular disease"
- Procedure: "transplanted kidney"